Clinical trial exclusion criterion:
Women with any issue that, in the opinion of the investigator, would interfere with study participation or generating accurate study data

Annotated entities:
- Non-representable: "Women with any issue that, in the opinion of the investigator, would interfere with study participation or generating accurate study data"